下列有關女性頸髓完全損傷患者的敘述，何者錯誤？
A. 排卵與受孕能力正常
B. 可以進行陰道性交
C. 生產時可能發生自律神經異常反射
D. 子宮收縮無力，需剖腹生產

正確答案：D. 子宮收縮無力，需剖腹生產